Treatment site has active skin lesion or inflammation

The above is a clinical trial exclusion criterion. Annotated with entity spans:
Treatment site has [Qualifier: active] [Condition: skin lesion] or [Condition: inflammation]